Clinical trial exclusion criteria:
myocardial infarction within the preceding 4 weeks
severe valve disease requiring valve replacement
cardiac reoperations

Annotated entities:
- Condition: "myocardial infarction"
- Temporal: "within the preceding 4 weeks"
- Reference_point: "the preceding 4 weeks"
- Qualifier: "severe"
- Condition: "valve disease"
- Qualifier: "requiring valve replacement"
- Procedure: "valve replacement"
- Procedure: "cardiac reoperations"